Medical conditions associated with female sexual dysfunction; cardiovascular disease, uncontrolled chronic HT (hypertension) ,DM (diabetes mellitus), History of gynecologic surgery, female gynecological cancer ( breast, ovarian, uterine, cervical)

The above is a clinical trial exclusion criterion. Annotated with entity spans:
[Condition: Medical conditions] [Qualifier: associated with female sexual dysfunction]; [Condition: cardiovascular disease], [Qualifier: uncontrolled] [Qualifier: chronic] [Condition: HT] ([Condition: hypertension]) ,[Condition: DM] ([Condition: diabetes mellitus]), [Temporal: History] of [Procedure: gynecologic surgery], [Condition: female gynecological cancer] ( [Condition: breast], [Condition: ovarian], [Condition: uterine], [Condition: cervical])